Clinical trial exclusion criterion:
Diagnosis of HCC

Annotated entities:
- Condition: "HCC"